精子生成（spermatogenesis）過程中，下列何者在第一次減數分裂（meiosis I）完成時產生？
A. 精原細胞（spermatogonium）
B. 初級精母細胞（primary spermatocyte）
C. 次級精母細胞（secondary spermatocyte）
D. 精細胞（spermatid）

正確答案：C. 次級精母細胞（secondary spermatocyte）